Clinical trial inclusion criterion:
Confirmation of glenohumeral OA via imaging

Entity relations:
- AND("imaging", "glenohumeral OA")